Patients with keloids on the intended biopsy site

The above is a clinical trial exclusion criterion. Annotated with entity spans:
Patients with [Condition: keloids] [Qualifier: on the intended biopsy site]